En la transducción de señales, el AMP cíclico actúa como activador alostérico de:
1. La ATP sintasa.
2. La adenilato ciclasa.
3. La proteína quinasa A (PKA).
4. La ADP quinasa.

Respuesta correcta: 3. La proteína quinasa A (PKA).